American Society of Anesthesiologists physical status class I-III

The above is a clinical trial inclusion criterion. Annotated with entity spans:
[Measurement: American Society of Anesthesiologists physical status] [Value: class I-III]